Current IUD

The above is a clinical trial exclusion criterion. Annotated with entity spans:
Current [Procedure: IUD]